Where do mitochondrial DNA deletion breakpoints tend to occur?

Non-B DNA conformations are a key element of the mtDNA deletion process and most of the analyzed deletion breakpoints showed nucleotide repeats flanking the deletions. Circular dichroism and UV spectral analysis demonstrated that mitochondrial G-rich sequences near deletion breakpoints prevalent in human disease form G-quadruplex DNA structures. Current findings suggest that mitochondrial G-quadruplexes are also likely to be a source of instability for the mitochondrial genome by perturbing the normal progression of the mitochondrial replication machinery, including DNA unwinding by Twinkle helicase.